下列何者不含有腦脊髓液（cerebrospinal fluid）？
A. 大池（cisterna magna）
B. 硬腦膜下腔（subdural space）
C. 蜘蛛腦膜下腔（subarachnoid space）
D. 脊髓中央管（central canal of spinal cord）

正確答案：B. 硬腦膜下腔（subdural space）